List available databases containing information about conserved noncoding elements.

Ancora and TFCONES.